Clinical trial inclusion criterion:
health medical history

Annotated entities:
- Temporal: "medical history"
- Qualifier: "health"